下列何者不是糖尿病第三腦神經病變之臨床表現？
A. 眼瞼下垂
B. 眼肌麻痺（ophthalmoplegia）
C. 瞳孔對光反應正常
D. 突眼

正確答案：D. 突眼